Clinical trial exclusion criterion:
Previous treatment with systemic corticosteroids or a change in dosage of thyroid hormones in the previous 6 weeks

Entity relations:
- Has_qualifier("thyroid hormones", "change in dosage")
- Has_temporal("systemic corticosteroids", "previous 6 weeks")
- OR("systemic corticosteroids", "thyroid hormones")